Clinical trial exclusion criterion:
presence of mobility in the selected tooth

Annotated entities:
- Condition: "mobility"
- Qualifier: "selected tooth"